下列關於酒精戒斷引起的癲癇發作（alcohol withdrawal seizures）的敘述，何者正確？
A. 90%以上在戒斷後 48 小時內發生
B. 通常為單純型部分發作（simple partial seizures）
C. 不會引起癲癇重積狀態（status epilepticus）
D. 需要長期以藥物控制以免再次發生

正確答案：A. 90%以上在戒斷後 48 小時內發生